一位 10 歲男童主訴皮膚癢，黃疸，且 2 小時前發生吐血。他在嬰兒時因膽道閉鎖而做了 Kasai operation，身體診察顯示其肝脾腫大，且腹部上有顯著之側枝循環。糞便呈黑色，潛血反應呈強陽性。下列何者最可能造成吐血的原因？
A. 胃潰瘍
B. 流鼻血
C. 十二指腸潰瘍
D. 食道靜脈瘤破裂

正確答案：D. 食道靜脈瘤破裂